Concern for inability of the patient to comply with study procedures and/or follow up (eg, alcohol or drug abuse)

The above is a clinical trial exclusion criterion. Annotated with entity spans:
[Mood: Concern for] [Observation: inability] of the patient to comply with study procedures and/or follow up (eg, [Condition: alcohol] or [Condition: drug abuse])